Clinical trial inclusion criterion:
Subjects for whom the investigator believes that their parents/guardians can and will comply with the requirements of the protocol

Annotated entities:
- Non-query-able: "Subjects for whom the investigator believes that their parents/guardians can and will comply with the requirements of the protocol"